Clinical trial inclusion criterion:
Documented freedom from AF recurrence (symptomatic or asymptomatic arrhythmic recurrences lasting longer than 30 seconds) 3 months after successful cardiac ablation (AF recurrence during 3-month blanking period is excluded).

Entity relations:
- Has_negation("AF recurrence", "freedom")
- Has_value("arrhythmic recurrences", "longer than 30 seconds")
- AND("AF recurrence", "arrhythmic recurrences")
- Has_index("3 months after successful cardiac ablation", "cardiac ablation")
- Has_temporal("AF recurrence", "3 months after successful cardiac ablation")